Currently taking active weight suppression medication (e.g. phentermine,orlistat, lorcaserin, naltrexone-bupropion in combination, liraglutide, benzephetamine, diethylpropion, phendimetrazine)

The above is a clinical trial exclusion criterion. Annotated with entity spans:
Currently taking [Drug: active weight suppression medication] (e.g. [Drug: phentermine],[Drug: orlistat], [Drug: lorcaserin], [Drug: naltrexone-bupropion in combination], [Drug: liraglutide], [Drug: benzephetamine], [Drug: diethylpropion], [Drug: phendimetrazine])